Participants having H. pylori related chronic gastritis with/without peptic ulcers who are aged greater than 20 years old and are willing to received eradication therapy.

The above is a clinical trial inclusion criterion. Annotated with entity spans:
Participants having [Qualifier: H. pylori related] [Condition: chronic gastritis] with/without [Condition: peptic ulcers] who are [Person: aged] [Value: greater than 20 years old] and are [Mood: willing to received] [Procedure: eradication therapy].